細菌表面的 pili 或 fimbriae 通常造成宿主致病力的機轉為何？
A. 附著至特定的細胞表面
B. 增強細菌的移動力
C. 抵抗吞噬作用
D. 增強內毒素的作用

正確答案：A. 附著至特定的細胞表面